Clinical trial exclusion criterion:
Are known to have protruding left ventricular thrombus or mechanical aortic and mitral valves

Entity relations:
- OR("left ventricular thrombus", "mechanical aortic valves", "mechanical mitral valves")